下列何者直接由掌淺弓（superficial palmar arch）分枝而來？
A. 指掌側總動脈（common palmar digital artery）
B. 掌骨掌側動脈（palmar metacarpal artery）
C. 指掌側固有動脈（proper palmar digital artery）
D. 拇主要動脈（princeps pollicis artery）

正確答案：A. 指掌側總動脈（common palmar digital artery）